Clinical trial inclusion criterion:
Bloodstream infection with Enterobacter spp., Serratia marcescens, Providencia spp., Morganella morganii or Citrobacter freundii (i.e. likely AmpC-producer), and susceptibility to 3rd generation cephalosporins (i.e. ceftriaxone, cefotaxime or ceftazidime), meropenem and piperacillin-tazobactam from at least one blood culture draw. This will be determined in accordance with laboratory methods and susceptibility breakpoints defined by protocols used in the recruiting site laboratories..

Annotated entities:
- Condition: "Bloodstream infection"
- Qualifier: "Enterobacter spp."
- Qualifier: "Serratia marcescens"
- Qualifier: "Providencia spp."
- Qualifier: "Morganella morganii"
- Qualifier: "Citrobacter freundii"
- Drug: "3rd generation cephalosporins ("
- Drug: "ceftriaxone"
- Drug: "cefotaxime"
- Drug: "ceftazidime"
- Drug: "meropenem"
- Drug: "piperacillin-tazobactam"
- Multiplier: "at least one"
- Measurement: "blood culture"